Clinical trial inclusion criteria:
1. Age 18-80 years
2. Patients with at least 1 ≥50% stenosis in a coronary vessel, subjected to FFR assessment, who exhibit variation in Pd / Pa ratio ≥ 0.05 (e.g. difference of max Pd/Pa minus min Pd/Pa) during steady state hyperaemia (determined by visual assessment).
3. Written informed consent

Annotated entities:
- Parsing_Error: "1."
- Person: "Age"
- Value: "18-80 years"
- Parsing_Error: "2."
- Multiplier: "at least 1"
- Value: "≥50%"
- Measurement: "stenosis in a coronary vessel"
- Procedure: "FFR assessment"
- Measurement: "Pd / Pa ratio"
- Value: "≥ 0.05"
- Measurement: "max Pd/Pa"
- Measurement: "min Pd/Pa"
- Condition: "hyperaemia"
- Qualifier: "steady state"
- Procedure: "visual assessment"
- Condition: "variation in Pd / Pa ratio"
- Parsing_Error: "3."